下列何者緊貼前列腺的頂部（apex）？
A. 直腸
B. 膀胱
C. 骨盆橫膈
D. 泌尿生殖橫膈

正確答案：D. 泌尿生殖橫膈